Unwillingness to tolerate menstrual irregularity

The above is a clinical trial exclusion criterion. Annotated with entity spans:
[Mood: Unwillingness to tolerate] [Condition: menstrual irregularity]